Currently undergoing chemotherapy

The above is a clinical trial exclusion criterion. Annotated with entity spans:
Currently undergoing [Procedure: chemotherapy]